Clinical trial exclusion criterion:
11. Uncontrolled diabetes with recent weight loss, diabetic coma, or frequent insulin reactions;

Entity relations:
- Has_qualifier("diabetes", "Uncontrolled")
- Has_multiplier("insulin reactions", "frequent")
- OR("diabetes", "insulin reactions", "weight loss", "diabetic coma")